下列有關成人之 Neurogenic tumors 的敘述，何者為非？
A. 常見有 neurilemmoma 及 neurofibromas
B. Neurilemmoma 可能伴隨 von Recklinghousen's disease，此時皮膚上可找到 Café au lait lesion
C. 約有 50%病人會有 spinal extension，俗稱 dumbbell tumor
D. 治療以手術切除為主

正確答案：C. 約有 50%病人會有 spinal extension，俗稱 dumbbell tumor